¿Cuál de las siguientes emociones facilita más intensamente las conductas de escape?
1. Tristeza.
2. Ira.
3. Asco.
4. Culpa.
5. Rabia.

Respuesta correcta: 3. Asco.